Patients with a calculated PRA of 0% by solid phase technique and absence of anti-HLA class I and class II antibodies by single antigen test (Luminex®).

The above is a clinical trial inclusion criterion. Annotated with entity spans:
Patients with a [Measurement: calculated PRA] of [Value: 0%] by [Qualifier: solid phase technique] and [Observation: absence of anti-HLA class I] and class II antibodies by [Procedure: single antigen test (Luminex®)].